Patients with uninvestigated macroscopic hematuria

The above is a clinical trial exclusion criterion. Annotated with entity spans:
Patients with [Qualifier: uninvestigated] [Condition: macroscopic hematuria]